Pregnancy or breastfeeding

The above is a clinical trial exclusion criterion. Annotated with entity spans:
[Pregnancy_considerations: Pregnancy or breastfeeding]